Para replicarse, los paramixovirus han de introducir en la célula su material genético y una:
1. DNA polimerasa RNA dependiente.
2. DNA polimerasa DNA dependiente.
3. RNA polimerasa RNA dependiente.
4. RNA polimerasa DNA dependiente.
5. No requieren la introducción de enzimas virales.

Respuesta correcta: 3. RNA polimerasa RNA dependiente.